Clinical trial exclusion criterion:
Subjects taking the following medications for at least six weeks, which may interfere with the study, will be excluded: BAS, antibiotics, anticoagulants, anticonvulsants, antiarrhythmic, Cyclosporine, Mycophenolate and Synthroid. Subjects with chronic diarrhea, gastric bypass or lap band procedures, ostomies, bowel motility problems, or other conditions that could affect intestinal fat absorption.

Annotated entities:
- Temporal: "for at least six weeks"
- Drug: "BAS"
- Drug: "antibiotics"
- Drug: "anticoagulants"
- Drug: "anticonvulsants"
- Drug: "antiarrhythmic"
- Drug: "Cyclosporine"
- Drug: "Mycophenolate"
- Drug: "Synthroid"
- Grammar_Error: "and"
- Condition: "chronic diarrhea"
- Procedure: "gastric bypass"
- Procedure: "lap band procedures"
- Procedure: "ostomies"
- Condition: "bowel motility problems"
- Condition: "conditions that could affect intestinal fat absorption"
- Undefined_semantics: "conditions that could affect intestinal fat absorption"